Clinical trial exclusion criterion:
History of psychiatric disorders or cognitive impairment

Entity relations:
- OR("psychiatric disorders", "cognitive impairment")